有關人類罹患河盲症（river blindness）的敘述，何者錯誤？
A. 蚋蠅屬（genus Simulium）昆蟲是造成本疾病的媒介
B. 成蟲寄生於患者的眼睛才造成眼盲
C. 硬化性角膜炎是引起眼盲的主因
D. 肇因於蟠尾絲蟲（Onchocerca volvulus）感染所致

正確答案：B. 成蟲寄生於患者的眼睛才造成眼盲